Telomestatin is derived from what organism?

Telomestatin is a natural macrocyclic compound derived from Streptomyces anulatus 3533-SV4